Clinical trial inclusion criterion:
In the investigator's opinion, the subject still has significant intraretinal fluid with room for improvement in both macular edema and BCVA.

Entity relations:
- Has_qualifier("intraretinal fluid", "significant")
- AND("with room for improvement", "macular edema")
- Has_qualifier("intraretinal fluid", "with room for improvement")
- multi("with room for improvement", "with room for improvement")
- AND("with room for improvement", "BCVA")